Hirschsprung's disease信賴度最高（gold standard）的診斷依據為何？
A. 超過48小時未解胎便
B. 肛門壓力計檢查（manometry study）
C. 直腸切片檢查（rectal biopsy）
D. 下消化道鋇劑檢查（lower GI barium enema）

正確答案：C. 直腸切片檢查（rectal biopsy）